Clinical trial exclusion criterion:
Use of monoamine oxidase inhibitors 21 days prior to study

Annotated entities:
- Drug: "monoamine oxidase inhibitors"
- Temporal: "21 days prior to study"
- Reference_point: "study"